Clinical trial exclusion criterion:
Patients with unstable occlusive disease (e.g., crescendo angina)

Annotated entities:
- Condition: "unstable occlusive disease"